Clinical trial inclusion criterion:
Diagnosed epileptic patients of either sex with age between 10-19 yrs (<19yrs), coming to the medicine Out Patient /In Patient Departments and undergoing AED therapy for more than 6 months.

Entity relations:
- Subsumes("between 10-19 yrs", "<19yrs")
- Has_temporal("AED therapy", "for more than 6 months")
- Has_value("age", "between 10-19 yrs")